Clinical trial inclusion criterion:
Intra parenchymatous hematoma

Annotated entities:
- Qualifier: "Intra parenchymatous"
- Condition: "hematoma"